Clinical trial inclusion criterion:
Extension of local tumor to involve adjacent organs other than seminal vesicles (T4)

Entity relations:
- Has_negation("seminal vesicles", "other than")
- Has_qualifier("Extension of local tumor", "adjacent organs")
- Has_qualifier("Extension of local tumor", "seminal vesicles")